Clinical trial inclusion criterion:
Anxiety Cohort: Meet DSM-5 criteria for any of the following anxiety disorders: Social Anxiety Disorders, Generalized Anxiety Disorder, Separation Anxiety Disorder and/or Panic Disorder by structured interview (MINI-KID); ADIS Clinical Severity Rating ≥4 (moderately severe) for any of the 4 included anxiety disorders; Failure to achieve remission with at least 1 adequate prior anxiolytic medication trial (e.g. SSRI, SNRI, or TCA), meaning at least 8 weeks at therapeutic dosing, including at least 4 weeks of stable dosing; Failure to achieve remission with previous CBT or subject declines current CBT therapy

Annotated entities:
- Observation: "Anxiety Cohort"
- Qualifier: "DSM-5 criteria"
- Condition: "anxiety disorders"
- Condition: "Social Anxiety Disorders"
- Condition: "Generalized Anxiety Disorder"
- Condition: "Separation Anxiety Disorder"
- Condition: "Panic Disorder"
- Procedure: "structured interview"
- Procedure: "MINI-KID"
- Measurement: "ADIS Clinical Severity Rating"
- Value: "≥4"
- Qualifier: "moderately severe"
- Condition: "anxiety disorders"
- Condition: "remission"
- Negation: "Failure"
- Multiplier: "at least 1"
- Qualifier: "adequate"
- Temporal: "prior"
- Procedure: "anxiolytic medication trial"
- Drug: "anxiolytic medication"
- Drug: "SSRI"
- Drug: "SNRI"
- Drug: "TCA"
- Multiplier: "at least 8 weeks"
- Procedure: "therapeutic dosing"
- Multiplier: "at least 4 weeks"
- Procedure: "stable dosing"
- Temporal: "previous"
- Procedure: "CBT therapy"
- Observation: "subject declines"
- Temporal: "current"
- Procedure: "CBT therapy"
- Condition: "remission"
- Negation: "Failure"